Clinical trial exclusion criterion:
Significant renal or hepatic disease as evidenced by a serum creatinine greater than 1.5× upper limit of normal (ULN), serum transaminases greater than 3× ULN, or total bilirubin greater than 1.5× ULN in absence of Gilbert's syndrome

Entity relations:
- Has_qualifier("renal disease", "Significant")
- Has_value("serum creatinine", "greater than 1.5× upper limit of normal (ULN)")
- Has_value("serum transaminases", "greater than 3× ULN")
- Has_negation("Gilbert's syndrome", "absence of")
- Has_value("total bilirubin", "greater than 1.5× ULN")
- AND("total bilirubin", "Gilbert's syndrome")
- AND("renal disease", "serum creatinine")
- OR("renal disease", "hepatic disease")
- OR("serum creatinine", "total bilirubin", "serum transaminases")